Los tripanosomoas africanos (T. Rhodesiense y T. Gambiense) se transmiten por insectos del género:
1. Glossina.
2. Triatoma.
3. Panstrongylus.
4. Rhodnius.
5. Phebotomus.

Respuesta correcta: 1. Glossina.